Clinical trial exclusion criterion:
Patients taking antipsychotics, mood stabilizer or any psychotropic medications besides antidepressants, except benzodiazepines or beta blockers or hypnotics

Entity relations:
- Has_negation("benzodiazepines", "except")
- Has_negation("antidepressants", "besides")
- OR("benzodiazepines", "beta blockers", "hypnotics")
- OR("antipsychotics", "mood stabilizer", "psychotropic medications")